Clinical trial inclusion criterion:
contact information is provided

Annotated entities:
- Post-eligibility: "contact information is provided"